Una mutación génica neutral:
1. Cambia un codón codificante por otro sinónimo sin alterar la secuencia de aminoácidos de la proteína.
2. Cambia un codón codificante por otro distinto y la proteína resulta distinta funcionalmente.
3. Genera una proteína no funcional.
4. Cambia la secuencia de aminoácidos de la proteína sin alterar su función.
5. Suprime el efecto de una mutación previa.

Respuesta correcta: 4. Cambia la secuencia de aminoácidos de la proteína sin alterar su función.